Clinical trial exclusion criterion:
Severe chronic insomnia, with reported usual sleep duration <4 hours

Annotated entities:
- Condition: "chronic insomnia"
- Observation: "sleep duration"
- Value: "<4 hours"